Clinical trial exclusion criterion:
Known allergic reactions to tenecteplase, clopidogrel, enoxaparin and aspirin

Annotated entities:
- Condition: "allergic reactions"
- Drug: "tenecteplase"
- Drug: "clopidogrel"
- Drug: "enoxaparin"
- Drug: "aspirin"